¿En qué parte de la célula se sintetiza el ARN ribosómico?:
1. Nucléolo.
2. Ribosomas.
3. Vacuolas.
4. Aparato de Golgi.
5. Retículo endoplasmático.

Respuesta correcta: 1. Nucléolo.